Probable or definite diagnosis of autoimmune hepatitis according to the International Autoimmune Hepatitis Study Group criteria

The above is a clinical trial inclusion criterion. Annotated with entity spans:
Probable or definite diagnosis of [Condition: autoimmune hepatitis] according to the [Measurement: International Autoimmune Hepatitis Study Group criteria]